罹患瀰漫性糞小桿線蟲症（disseminated strongyloidiasis stercoralis）的病患，通常有下列那些現象？①蟲體僅 侵犯腸道及肺臟 ②容易發生在免疫缺陷的病人 ③嗜酸性白血球增加不明顯
A. 僅①②
B. 僅①③
C. 僅②③
D. ①②③

正確答案：C. 僅②③